Clinical trial exclusion criterion:
Meets criteria for Major Depressive Episode, by Diagnostic Statistical Manual of Mental Disorder - IV (TR) criteria

Entity relations:
- Has_value("Diagnostic Statistical Manual of Mental Disorder - IV (TR) criteria", "Meets")
- AND("Major Depressive Episode", "Diagnostic Statistical Manual of Mental Disorder - IV (TR) criteria")